有些蛋白質係由多條獨立的多肽鏈（或稱蛋白質次單元）組合而成，這些次單元間在三度空間中的排列方式稱為蛋白質的：
A. 二級結構（secondary structure）
B. 超二級結構（supersecondary structure）
C. 三級結構（tertiary structure）
D. 四級結構（quaternary structure）

正確答案：D. 四級結構（quaternary structure）